known or suspected hypersensitivity to empagliflozin, glimepiride, or any excipients; and / or known or suspected hypersensitivity to sulfonylureas, sulfonamides or SGLT2 inhibitors in general

The above is a clinical trial exclusion criterion. Annotated with entity spans:
known or suspected [Condition: hypersensitivity] to [Drug: empagliflozin], [Drug: glimepiride], or any excipients; and / or known or suspected [Condition: hypersensitivity] to [Drug: sulfonylureas], [Drug: sulfonamides] or [Drug: SGLT2 inhibitors] in general